Clinical trial exclusion criterion:
Administration of immunoglobulins and/or any blood products within the three months preceding the first vaccination or during the study.

Entity relations:
- Has_temporal("vaccination", "first")
- multi("the first vaccination", "vaccination")
- Has_index("within the three months preceding the first vaccination", "the first vaccination")
- Has_temporal("immunoglobulins", "within the three months preceding the first vaccination")
- Has_index("during the study", "the study")
- OR("immunoglobulins", "any blood products")
- OR("within the three months preceding the first vaccination", "during the study")